Las células de Purkinje del cerebelo reciben aferencias directas de:
1. Neuronas espinales.
2. Neuronas de núcleos cerebelosos profundos.
3. Fibras trepadoras.
4. Fibras musgosas.
5. Neuronas piramidales de corteza cerebral.

Respuesta correcta: 3. Fibras trepadoras.